Clinical trial inclusion criterion:
Primary total hip arthroplasty (THA)

Annotated entities:
- Qualifier: "Primary"
- Condition: "total hip arthroplasty"
- Condition: "THA"